Los glucocorticoides son hormonas que se sintetizan a partir de:
1. Colesterol.
2. Glucosa.
3. Glucagón.
4. Insulina.
5. Colina.

Respuesta correcta: 1. Colesterol.